presence of typical HF symptoms and signs

The above is a clinical trial inclusion criterion. Annotated with entity spans:
presence of [Qualifier: typical] [Condition: HF symptoms] and signs